Women of child-bearing potential, defined as all women physiologically capable of becoming pregnant, unless they are using highly effective methods of contraception during the study and for 30 days after the final dose of nilotinib.

The above is a clinical trial exclusion criterion. Annotated with entity spans:
[Person: Women] of [Observation: child-bearing potential], defined as all [Person: women] [Observation: physiologically capable of becoming pregnant], [Negation: unless] they are using [Qualifier: highly effective methods] of [Observation: contraception] [Temporal: during the study] and [Temporal: for 30 days after the final dose of nilotinib].